Clinical trial inclusion criterion:
contraindication to treatment drugs,

Annotated entities:
- Condition: "contraindication"
- Drug: "treatment drugs"